healthy parturients with uncomplicated, single gestation pregnancies, full term (38-42 weeks of gestation) pregnancy, agreed to participate

The above is a clinical trial inclusion criterion. Annotated with entity spans:
[Condition: healthy] [Person: parturients] with [Qualifier: uncomplicated], [Qualifier: single gestation] [Condition: pregnancies], [Qualifier: full term] ([Value: 38-42] [Measurement: weeks of gestation]) [Condition: pregnancy], [Informed_consent: agreed to participate]